El test de O´Sullivan consiste en:
1. Administrar 50 g de glucosa oral y determinar la glucemia basal y una hora postingesta.
2. Administrar 100 g de glucosa oral y determinar la glucemia basal y una hora postingesta y dos horas postingesta.
3. Administrar 100 g de glucosa oral y determinar la glucemia basal, y tres determinaciones postingesta separadas de una hora en cada una.
4. Administrar 50 g de glucosa oral y determinar la glucemia basal y dos horas postingesta.

Respuesta correcta: 1. Administrar 50 g de glucosa oral y determinar la glucemia basal y una hora postingesta.